Normal and healthy (immune competent) as determined by medical history, physical exam, vital signs and clinical laboratory tests during the screening period.

The above is a clinical trial inclusion criterion. Annotated with entity spans:
[Qualifier: Normal] and [Qualifier: healthy] (immune competent) as determined by [Temporal: medical history], [Procedure: physical exam], [Measurement: vital signs] and [Measurement: clinical laboratory tests] [Temporal: during the screening period].